Weight < 800 g;

The above is a clinical trial exclusion criterion. Annotated with entity spans:
[Measurement: Weight] [Value: < 800 g];